Clinical trial exclusion criterion:
Subjects who have been treated over maximum maintenance dose (as specified in each label) of oral antipsychotics at screening. (e.g. Aripiprazole>30mg/day, Olanzapine>20mg/day, Risperidone > 6mg/day, Quetiapine > 750mg/day)

Annotated entities:
- Multiplier: "maximum maintenance dose"
- Drug: "oral antipsychotics"
- Temporal: "at screening"
- Drug: "Aripiprazole"
- Drug: "Olanzapine"
- Drug: "Risperidone"
- Drug: "Quetiapine"
- Value: "> 750mg/day"
- Value: "> 6mg/day"
- Value: ">20mg/day"
- Value: ">30mg/day"